Clinical trial exclusion criterion:
Patients with severe-complicated disease that would compromise oral therapy (hypotenstion or shock, ileus or bowel obstruction, megacolon).

Annotated entities:
- Condition: "hypotenstion"
- Condition: "shock"
- Condition: "ileus"
- Condition: "bowel obstruction"
- Condition: "megacolon"
- Non-query-able: "Patients with severe-complicated disease that would compromise oral therapy"